What is the link between TB (Turbeculosis) infection and TNFa inhibition?

The occurrence of tuberculosis (TB) in patients treated with immunosuppressive drugs (ISD) is an old problem that has been highlighted by cases occurring in patients using anti-TNFalpha drugs.